有關典型心絞痛（angina pectoris）之敘述，下列何者最不適當？
A. 通常胸痛持續約 2 至 5 分鐘，其不適感可投射到肩部或上肢
B. 胸痛亦可能投射至後背、下頜（jaw）及頸部
C. 心絞痛常可投射至斜方肌（trapezius muscle）
D. 心絞痛很少發生於肚臍下區域

正確答案：C. 心絞痛常可投射至斜方肌（trapezius muscle）